Clinical trial exclusion criterion:
Patients with an allergic reaction to sulfonamide.

Annotated entities:
- Condition: "allergic reaction"
- Drug: "sulfonamide"